Clinical trial inclusion criteria:
Previous diagnoses of COPD and HF under optimized clinical treatment as judged by the accompanying physician
Reduced left ventricular ejection fraction (<50%)
Non-reversible airway obstruction (post-bronchodilator FEV1/FVC < 0.7 and FEV1 < 80 %)
Respiratory muscle weakness (Pi,max < 70cmH2O)
Persistent dyspnea on daily life (Baseline Dyspnea Index focal score <or= 8).

Annotated entities:
- Condition: "COPD"
- Condition: "HF"
- Procedure: "clinical treatment"
- Qualifier: "optimized"
- Value: "Reduced"
- Measurement: "left ventricular ejection fraction"
- Value: "<50%"
- Condition: "airway obstruction"
- Qualifier: "Non-reversible"
- Measurement: "FEV1/FVC"
- Qualifier: "post-bronchodilator"
- Value: "< 0.7"
- Measurement: "FEV1"
- Value: "< 80 %"
- Condition: "Respiratory muscle weakness"
- Measurement: "Pi,max"
- Value: "< 70cmH2O"
- Condition: "dyspnea on daily life"
- Temporal: "Persistent"
- Temporal: "Baseline"
- Measurement: "Dyspnea Index focal score"
- Value: "<or= 8"